RTV to COBI/COBI-containing fixed-dose combination regimens

The above is a clinical trial inclusion criterion. Annotated with entity spans:
[Drug: RTV] to [Drug: COBI]/[Procedure: COBI-containing fixed-dose combination regimens]